Patients where antibiotic therapy has already been started (prior to randomization)

The above is a clinical trial inclusion criterion. Annotated with entity spans:
Patients where [Drug: antibiotic therapy] has already been started ([Temporal: prior to randomization])